Mild Cognitive Impairment or Dementia

The above is a clinical trial exclusion criterion. Annotated with entity spans:
[Condition: Mild Cognitive Impairment] or [Condition: Dementia]